Clinical trial exclusion criterion:
Sever liver impairment (liver failure)

Annotated entities:
- Qualifier: "Sever"
- Condition: "liver impairment"
- Condition: "liver failure"